Clinical trial inclusion criterion:
Women subjected to ICSI through controlled ovarian hyperstimulation (COH) with pituitary downregulation by GnRHa.

Entity relations:
- Subsumes("ICSI", "controlled ovarian hyperstimulation (COH)")
- Subsumes("ICSI", "pituitary downregulation by GnRHa")